Clinical trial inclusion criterion:
American Society of Anesthesiology class I-III

Annotated entities:
- Measurement: "American Society of Anesthesiology class"
- Value: "I-III"